70 歲男性，右上肺葉有一 5 公分的腫瘤，有臟層肋膜（visceral pleura）的侵犯。切片證實為非小細胞肺癌（non-small cell lung cancer）。手術後證實右側氣管前淋巴結為陽性，此外無其它癌症侵犯或轉移。根據 AJCC 第 7 版的分期，請選出最合適的選項：
A. T classification 為 T3
B. N classification 為 N1
C. 為第 IIIa 期
D. 為第 IIb 期

正確答案：C. 為第 IIIa 期